No use of non-steroid anti-inflammatory agent one week before operation

The above is a clinical trial inclusion criterion. Annotated with entity spans:
[Negation: No] use of [Drug: non-steroid anti-inflammatory agent] [Temporal: one week before operation]